Clinical trial exclusion criterion:
5. Recent initiation (<8 weeks from Screening) or planned initiation of cardiopulmonary rehabilitation exercise program.

Annotated entities:
- Parsing_Error: "5."
- Temporal: "<8 weeks from Screening"
- Temporal: "Recent"
- Reference_point: "Screening"
- Qualifier: "planned"
- Non-query-able: "planned"
- Procedure: "cardiopulmonary rehabilitation exercise program"